Clinical trial exclusion criterion:
ASA>3

Annotated entities:
- Measurement: "ASA"
- Value: ">3"